History or known presence of central nervous system (CNS) or spinal cord tumor (e.g., meningioma, glioma)

The above is a clinical trial exclusion criterion. Annotated with entity spans:
History or known presence of [Condition: central nervous system (CNS)] or [Condition: spinal cord tumor] (e.g., [Condition: meningioma], [Condition: glioma])